Clinical trial inclusion criterion:
Age between 1 month and 24 months of age (not beyond second birthday at baseline).

Annotated entities:
- Person: "Age"
- Value: "between 1 month and 24 months of age"